=1 ill-defined hyperfluorescent leakage areas on fluorescein angiography (FA) with retinal pigment epithelial window defect(s) that are compatible with cCSC;

The above is a clinical trial inclusion criterion. Annotated with entity spans:
[Multiplier: =1] [Qualifier: ill-defined] [Condition: hyperfluorescent leakage areas] on [Procedure: fluorescein angiography (FA)] with [Condition: retinal pigment epithelial window defect(s)] [Non-representable: that are compatible with cCSC];